Clinical trial exclusion criterion:
Hypertension (currently taking anti-hypertensive medications or resting blood pressure >140/90 mmHg)

Entity relations:
- Has_value("resting blood pressure", ">140/90 mmHg")
- Subsumes("Hypertension", "anti-hypertensive medications")
- OR("anti-hypertensive medications", "resting blood pressure")